Structural brain abnormalities on any prior imaging with associated clinically evident manifestations

The above is a clinical trial exclusion criterion. Annotated with entity spans:
[Condition: Structural brain abnormalities] on [Qualifier: any] [Temporal: prior] [Procedure: imaging] with associated [Qualifier: clinically evident] [Condition: manifestations]